Adequate family support

The above is a clinical trial inclusion criterion. Annotated with entity spans:
[Subjective_judgement: Adequate family support]